¿Cuál es el único reservorio natural de Mycobacterium tuberculosis?
1. Simio.
2. Humano.
3. Ratas.
4. Ganado bovino.

Respuesta correcta: 2. Humano.